Clinical trial exclusion criterion:
Have not received influenza vaccination in the past or cannot be vaccinated due to previous severe reaction to influenza vaccine, egg, latex, or thimerosol allergies, or refusal of vaccination

Entity relations:
- Has_negation("influenza vaccination", "not")